Clinical trial exclusion criterion:
Cardiovascular symptoms (angina, limiting dyspnoea during normal physical activity)

Annotated entities:
- Condition: "Cardiovascular symptoms"
- Condition: "angina"
- Condition: "dyspnoea"